對於神經內分泌瘤（neuroendocrine tumor）的敘述，下列何者最正確？
A. 為良性腫瘤
B. 只發生在腸胃道與胰臟
C. 注射體抑素類似物（somatostatin analogue），為最有效的治療方式
D. 可能合併腦下垂體腫瘤或副甲狀腺瘤

正確答案：D. 可能合併腦下垂體腫瘤或副甲狀腺瘤